breast cancer

The above is a clinical trial inclusion criterion. Annotated with entity spans:
[Condition: breast cancer]